Children undergoing elective tonsillectomy or adenotonsillectomy at Children's Healthcare of Atlanta Egleston location

The above is a clinical trial inclusion criterion. Annotated with entity spans:
[Person: Children] undergoing [Qualifier: elective] [Procedure: tonsillectomy] or [Procedure: adenotonsillectomy] at [Visit: Children's Healthcare of Atlanta Egleston] location